En un análisis electrogravimétrico:
1. El aumento de masa del electrodo nos indica la cantidad de analito.
2. El rendimiento en corriente deber ser del 100%.
3. Se utiliza siempre como electrodo de trabajo una malla de platino.
4. Se necesita siempre un electrodo de referencia.
5. No se necesita que la disolución sea conductora.

Respuesta correcta: 1. El aumento de masa del electrodo nos indica la cantidad de analito.